下列關於HIV（Human immunodeficiency virus）的敘述，何者錯誤？
A. M-tropic病毒會利用CXCR4當作其細胞的受器之一
B. T-tropic病毒通常會隨	病人病程的進展而增加
C. Kaposi's sarcoma是常見於愛滋病人的癌症
D. CD4 T細胞數目降至200/µL 以下，易出現伺機性感染

正確答案：A. M-tropic病毒會利用CXCR4當作其細胞的受器之一